Clinical trial inclusion criterion:
FIBRO Spect II Index consistent with F0- F2 AND APRI of = 1 during Screening

Entity relations:
- Has_value("APRI", "= 1")
- Has_value("FIBRO Spect II Index", "F0- F2")
- AND("FIBRO Spect II Index", "APRI")
- Has_temporal("FIBRO Spect II Index", "during Screening")